history of gastric resection surgery

The above is a clinical trial exclusion criterion. Annotated with entity spans:
history of [Procedure: gastric resection surgery]